Clinical trial exclusion criterion:
Patients cannot begin psychotherapy during the study period, but may continue if started prior to the study.

Annotated entities:
- Non-representable: "Patients cannot begin psychotherapy during the study period, but may continue if started prior to the study"